與顯微組織皮瓣（microvascular free flaps）比較之下，局部皮瓣（local flaps）有下列限制，何者錯誤？
A. 局部皮瓣（local flaps）的覆蓋範圍是受限制的
B. 局部皮瓣（local flaps）的遠端之血液循環可能不好
C. 在外傷的情況下局部皮瓣（local flaps）可能受傷，不一定可靠
D. 老人的局部皮瓣（local flaps）與年輕病患的局部皮瓣一樣可靠

正確答案：D. 老人的局部皮瓣（local flaps）與年輕病患的局部皮瓣一樣可靠